What cellular process is the protein clathrin involved in?

Clathrin plays a critical role in endocytosis and in many other cellular processes